Eligible for percutaneous coronary intervention with Absorb Bioresorbable Vascular Scaffold or Everolimus Eluting Stent

The above is a clinical trial inclusion criterion. Annotated with entity spans:
[Mood: Eligible for] [Procedure: percutaneous coronary intervention] with [Device: Absorb Bioresorbable Vascular Scaffold] or [Device: Everolimus Eluting Stent]